Regularly taking prescribed analgesia

The above is a clinical trial exclusion criterion. Annotated with entity spans:
[Qualifier: Regularly] taking prescribed [Drug: analgesia]